Clinical trial exclusion criterion:
With severe cardiovascular disease, or mental

Entity relations:
- Has_qualifier("cardiovascular disease", "severe")
- OR("cardiovascular disease", "disease mental")